一位50歲男性；最近二週，尿液變深、灰白便、身體發癢、皮膚逐漸變黃，因此到院檢查。身體診察發現鞏膜變黃，下肢無水腫，其CT影像上可見胰臟頭部有4公分左右腫瘤合併總膽管及胰管擴大，針對此病患安排下列處置何者最不適當？
A. 安排血管攝影栓塞
B. 測定CEA，CA19-9
C. 進行ERCP（endoscopic retrograde cholangiopancreatography）或EUS（endoscopic ultrasonography）合併切片
D. 進行核磁共振膽胰攝影（MRCP）

正確答案：A. 安排血管攝影栓塞